At least one CTO lesions located in proximal or mid epicardial coronary artery. (If the patient has two CTO lesions, one CTO lesion should be located in proximal or mid epicardial coronary artery)

The above is a clinical trial inclusion criterion. Annotated with entity spans:
[Multiplier: At least one] [Condition: CTO lesions] located [Qualifier: in proximal] or [Qualifier: mid epicardial coronary artery]. ([Parsing_Error: If the patient has two CTO lesions, one CTO lesion should be located in proximal or mid epicardial coronary artery])